Clinical trial exclusion criterion:
women undergoing caesarean section at less than 37 weeks of gestation.

Annotated entities:
- Person: "women"
- Procedure: "caesarean section"
- Temporal: "undergoing"
- Value: "less than 37 weeks"
- Measurement: "gestation"